Clinical trial exclusion criterion:
3. Are physically unable to sit upright and still for 40 minutes

Entity relations:
- Has_multiplier("physically unable to sit upright and still", "for 40 minutes")